The virus that causes FIP, Feline Infectious Peritonitis belongs to what family?

Feline Infectious Peritonitis virus (FIP) belongs to the coronavirus family of the genus Flavivirus which cause central nervous system disease.